Clinical trial inclusion criterion:
Fluent in English.

Annotated entities:
- Non-query-able: "Fluent in English."